Child-Pugh score > 12

The above is a clinical trial exclusion criterion. Annotated with entity spans:
[Measurement: Child-Pugh score] [Value: > 12]